Clinical trial exclusion criterion:
Comorbidities such as uncontrolled cardiovascular disease, i.e., unstable systemic arterial hypertension, coronary artery disease; previous stroke; OSA; pneumothorax in the last 2 months.

Entity relations:
- Has_qualifier("systemic arterial hypertension", "unstable")
- Has_temporal("pneumothorax", "in the last 2 months")
- Has_qualifier("cardiovascular disease", "uncontrolled")
- Has_temporal("stroke", "previous")
- Subsumes("Comorbidities", "cardiovascular disease")
- OR("cardiovascular disease", "systemic arterial hypertension", "coronary artery disease", "stroke", "OSA", "pneumothorax")